Contraindications to hormonal contraceptive use per package insert, including history of deep vein thrombosis, smoking in women older than 35 years

The above is a clinical trial exclusion criterion. Annotated with entity spans:
[Observation: Contraindications to hormonal contraceptive] use per package insert, including history of [Condition: deep vein thrombosis], [Observation: smoking] in [Person: women] [Value: older than 35 years]